Planned cardiac surgery or planned major non-cardiac surgery within the study period.

The above is a clinical trial exclusion criterion. Annotated with entity spans:
[Mood: Planned] [Procedure: cardiac surgery] or [Mood: planned] [Qualifier: major] [Negation: non]-[Qualifier: cardiac] [Procedure: surgery] [Temporal: within the study period].